關於顱內壓上升的徵象（sign），下列何者錯誤？
A. 神智狀態變差
B. 瞳孔擴張且對光反應變差
C. 心跳變快
D. 血壓上升

正確答案：C. 心跳變快